5. Currently taking immunomodulatory medication, i.e. interferon.

The above is a clinical trial exclusion criterion. Annotated with entity spans:
5. Currently taking [Drug: immunomodulatory medication], i.e. [Drug: interferon].